相較於其他病因引起的腦炎，腸病毒71型腦炎特別容易出現下列那一種徵候？
A. 腦出血（brain hemorrhage）
B. 顳葉腦炎（temporal lobe encephalitis）
C. 錐體外症候群（extrapyramidal syndrome）
D. 肌陣攣（myoclonus）

正確答案：D. 肌陣攣（myoclonus）